Pregnancy or breast-feeding.

The above is a clinical trial exclusion criterion. Annotated with entity spans:
[Pregnancy_considerations: Pregnancy or breast-feeding].